Medical history of personal drug or alcohol addiction or abuse

The above is a clinical trial exclusion criterion. Annotated with entity spans:
Medical history of personal [Qualifier: drug] or [Qualifier: alcohol] [Condition: addiction] or [Condition: abuse]